Clinical trial exclusion criterion:
conditions that may lead to complicated infections (i.e. renal diseases, patients with urinary catheter)

Annotated entities:
- Condition: "conditions"
- Condition: "complicated infections"
- Condition: "renal diseases"
- Device: "urinary catheter"
- Person: "patients"